La sensibilidad clínica de un parámetro (test) analítico se define como:
1. La media de concentraciones de dicho test en pacientes sanos.
2. Una concentración patológica del test en presencia de la enfermedad.
3. Una concentración patológica del test en ausencia de la enfermedad.
4. Una concentración normal del test en ausencia de la enfermedad.
5. Una concentración normal del test en presencia de la enfermedad.

Respuesta correcta: 2. Una concentración patológica del test en presencia de la enfermedad.